Able to complete the Evaluation to Sign Consent (ESC) with minimum score of 80%

The above is a clinical trial inclusion criterion. Annotated with entity spans:
[Observation: Able to complete] the [Procedure: Evaluation to Sign Consent (ESC)] with [Value: minimum score of 80%]